Clinical trial inclusion criterion:
Cruciate ligament of the knee reconstructive surgery

Annotated entities:
- Procedure: "reconstructive surgery"
- Qualifier: "Cruciate ligament of the knee"